Written informed consent obtained prior to enrolling in roll-over study

The above is a clinical trial inclusion criterion. Annotated with entity spans:
[Observation: Written informed consent] obtained [Temporal: prior to enrolling in roll-over study]